身心障礙者的復健目標不包括下列何者？
A. 將患者功能訓練至最高極限
B. 利用輔具協助解決日常生活困難
C. 治癒殘障
D. 協助患者重新在社會扮演應有的角色

正確答案：C. 治癒殘障